If local anesthetic allergy is present

The above is a clinical trial exclusion criterion. Annotated with entity spans:
If [Drug: local anesthetic] [Condition: allergy] is present